Active autoimmune disease that has required systemic treatment in past 2 years

The above is a clinical trial exclusion criterion. Annotated with entity spans:
[Temporal: Active] [Condition: autoimmune disease] that has required [Procedure: systemic treatment] [Temporal: in past 2 years]